Clinical trial exclusion criterion:
Documented thromboembolic event (including TIA) within the past 12 months (365 days)

Annotated entities:
- Condition: "thromboembolic event"
- Condition: "TIA"
- Temporal: "within the past 12 months"
- Temporal: "within the past 365 days"